橫膈的右腳（right crus of the diaphragm）圍繞	下列那一個構造？
A. 主動脈
B. 下腔靜脈
C. 食道
D. 肝門靜脈

正確答案：C. 食道